Clinical trial exclusion criterion:
Cardio-vascular pathologies, evoluting and uncontrolled, (severe HTA), cardiac deficiency, severe angor, severe arrhythmia.

Annotated entities:
- Condition: "Cardio-vascular pathologies"
- Qualifier: "uncontrolled"
- Qualifier: "evoluting"
- Condition: "HTA"
- Qualifier: "severe"
- Condition: "cardiac deficiency"
- Condition: "angor"
- Condition: "arrhythmia"
- Qualifier: "severe"
- Qualifier: "severe"